Clinical trial exclusion criterion:
People with missing hand(s) and/or leg(s)

Annotated entities:
- Condition: "missing hand"
- Condition: "missing leg"